a single or dual chamber MRI conditional pacemaker (BSCI) or

The above is a clinical trial inclusion criterion. Annotated with entity spans:
a [Qualifier: single] or [Qualifier: dual chamber] [Qualifier: MRI conditional] [Device: pacemaker] ([Device: BSCI]) or